當病患有先天性粒線體變異（如 12S rRNA 突變）時，特別會增加下列那種藥物引起藥物耳毒性（ ototoxicity）之機會？
A. 奎寧（quinine）
B. 鉑金類抗癌藥物（cisplatin 等）
C. 氨基醣苷類抗生素（aminoglycoside antibiotics）
D. 非類固醇消炎藥（NSAIDs，如 ibuprofen, naproxen 等）

正確答案：C. 氨基醣苷類抗生素（aminoglycoside antibiotics）